Subject has structural normal heart with an LVEF = 50%, thickness of the inter-ventricular septum =12 mm and left atrium diameters (short axis) < 46 mm obtained by transthoracic echocardiography.

The above is a clinical trial inclusion criterion. Annotated with entity spans:
Subject has [Qualifier: structural] [Qualifier: normal] [Condition: heart] with an [Measurement: LVEF] [Value: = 50%,] [Measurement: thickness of the inter-ventricular septum] [Value: =12 mm] and [Measurement: left atrium diameters] ([Measurement: short axis]) [Value: < 46 mm] obtained by [Procedure: transthoracic echocardiography].